關於腸內桿菌科（Enterobacteriaceae）O抗原（O antigen）的敘述，下列何者正確？
A. 是控制物質進出細菌的通道
B. 具有鞭毛蛋白（flagellin）
C. 細菌細胞壁脂多醣體（lipopolysaccharide）的一部分
D. 含胜肽聚醣（peptidoglycan），可用來維持細菌細胞壁的形態

正確答案：C. 細菌細胞壁脂多醣體（lipopolysaccharide）的一部分